eGFR <60 T2DM patients on insulin, GLP-1 RA or SGLT2 treatment Major organ disease type 1 diabetes

The above is a clinical trial exclusion criterion. Annotated with entity spans:
[Line: eGFR <60] [Line: T2DM patients on insulin, GLP-1 RA or SGLT2 treatment] [Condition: Major organ disease] [Condition: type 1 diabetes]